Candidate for topical anti-inflammatory

The above is a clinical trial exclusion criterion. Annotated with entity spans:
[Mood: Candidate for] [Drug: topical anti-inflammatory]